Has clear corneas and no active ocular disease

The above is a clinical trial inclusion criterion. Annotated with entity spans:
Has [Condition: clear corneas] and [Negation: no] [Temporal: active] [Condition: ocular disease]